a very high cardiovascular risk and LDL-cholesterol> 1.8 mmol / l

The above is a clinical trial inclusion criterion. Annotated with entity spans:
a [Qualifier: very high] [Condition: cardiovascular risk] and [Measurement: LDL-cholesterol][Value: > 1.8 mmol / l]